由 6 個穿過細胞膜的 connexins 組成一很小的管道，只容許 2 nm 大小的物質通過，這種接合稱為：
A. 緊密接合（tight junction）
B. 間隙接合（gap junction）
C. 黏連接合（adhering junction）
D. 半胞橋小體（hemidesmosome）

正確答案：B. 間隙接合（gap junction）